End stage chronic renal disease: Subjects will be excluded if on renal replacement therapy (hemodialysis or peritoneal).

The above is a clinical trial exclusion criterion. Annotated with entity spans:
[Condition: End stage chronic renal disease]: Subjects will be excluded if on [Procedure: renal replacement therapy] ([Procedure: hemodialysis] or [Qualifier: peritoneal]).